Where in the body would the navicular bone be found?

The navicular bone is located in the foot